Clinical trial exclusion criterion:
History of diabetic ketoacidosis, precoma diabetica, or diabetic coma

Annotated entities:
- Condition: "diabetic ketoacidosis"
- Temporal: "History"
- Condition: "precoma diabetica"
- Condition: "diabetic coma"